any serious adverse events that have a causal relationship with the inoculation of the upper dose of the vaccine

The above is a clinical trial exclusion criterion. Annotated with entity spans:
any [Qualifier: serious] [Condition: adverse events] that have a causal relationship with the [Procedure: inoculation of the upper dose of the vaccine]